Clinical trial exclusion criterion:
Clinical diagnosis of hepatic or renal disease

Entity relations:
- Has_qualifier("hepatic disease", "Clinical diagnosis")
- OR("hepatic disease", "renal disease")